Clinical trial inclusion criterion:
singleton pregnancy

Entity relations:
- Has_qualifier("pregnancy", "singleton")